Clinical trial exclusion criterion:
Uncontrolled hypertension with systolic BP >160 mmHg or diastolic BP >95 mmHg.

Annotated entities:
- Condition: "hypertension"
- Qualifier: "Uncontrolled"
- Measurement: "systolic BP"
- Measurement: "diastolic BP"
- Value: ">160 mmHg"
- Value: ">95 mmHg"